With which personality traits has the human monoamine oxidase A (MAOA) gene been associated?

Association of monoamine oxidase-A genetic variants and amygdala morphology in violent offenders with antisocial personality disorder and high psychopathic traits.